¿La capacidad de una droga para suprimir el síndrome de abstinencia producido por otra droga, se conoce con el nombre de?:
1. Politoxicomanía.
2. Patología dual.
3. Craving.
4. Dependencia cruzada.

Respuesta correcta: 4. Dependencia cruzada.